Treatment with glycoprotein IIb/IIIa inhibitors

The above is a clinical trial exclusion criterion. Annotated with entity spans:
Treatment with [Drug: glycoprotein IIb/IIIa inhibitors]